María, gestante de 20 semanas con factor Rh negativo, le pregunta a su enfermera en qué momento del embarazo y el postparto le administrarán la gammaglobulina anti-D. ¿Cuál será la respuesta correcta de la enfermera?:
1. Se administra una dosis en la semana 28 de gestación de la gestación y otra dentro de las 72 horas posteriores al nacimiento del recién nacido si su factor Rh es positivo.
2. Se administra una dosis en la semana 28 de gestación y otra dentro de las 48 horas posteriores al nacimiento del recién nacido si su factor Rh es positivo.
3. Se administra una dosis en la semana 28 de gestación y otra dentro de las 24 horas posteriores al nacimiento del recién nacido si su factor Rh es positivo.
4. Se administra una dosis en la semana 28 de gestación y otra dentro de las 12 horas posteriores al nacimiento del recién nacido si su factor Rh es positivo.

Respuesta correcta: 1. Se administra una dosis en la semana 28 de gestación de la gestación y otra dentro de las 72 horas posteriores al nacimiento del recién nacido si su factor Rh es positivo.